Clinical trial exclusion criterion:
QTc >500 milliseconds on EKG at screening.

Entity relations:
- Has_value("QTc", ">500 milliseconds")
- Has_index("at screening", "screening")
- AND("EKG", "QTc")